Patient must have level of serum testosterone above the lower limit of normal.

The above is a clinical trial inclusion criterion. Annotated with entity spans:
Patient must have [Measurement: level of serum testosterone] [Value: above the lower limit of normal].